Clinical trial exclusion criterion:
Women who are pregnant or nursing/breastfeeding.

Entity relations:
- OR("pregnant", "nursing", "breastfeeding")